patients with severe allergic constitution, or those who are allergic to or intolerant of drug composition in chemotherapy regimens; with other malignant tumors in the past 5 years;

The above is a clinical trial exclusion criterion. Annotated with entity spans:
patients with [Qualifier: severe] [Condition: allergic] constitution, or those who are [Condition: allergic] to or [Condition: intolerant] of drug composition in [Procedure: chemotherapy regimens]; with [Qualifier: other] [Condition: malignant tumors] in the [Temporal: past 5 years];